Clinical trial inclusion criterion:
one additional cytotoxic regimen and/or PARP inhibitor for management of recurrent or persistent disease.

Annotated entities:
- Drug: "cytotoxic regimen"
- Drug: "PARP inhibitor"
- Multiplier: "one additional"
- Condition: "disease"
- Temporal: "persistent"
- Temporal: "recurrent"
- Undefined_semantics: "disease"